Age between 18 and 78 year-old.

The above is a clinical trial inclusion criterion. Annotated with entity spans:
[Person: Age] [Value: between 18 and 78 year-old].